Clinical trial inclusion criteria:
primary total knee replacement surgery
ASA (american society of anesthesiologists) class 1-3

Annotated entities:
- Procedure: "total knee replacement surgery"
- Qualifier: "primary"
- Measurement: "ASA class"
- Value: "1-3"
- Measurement: "american society of anesthesiologists"